Clinical trial exclusion criterion:
Allergy to porphyrins and analogues; Photosensitivity; Porphyria; Allergic constitution;

Entity relations:
- AND("Allergy", "porphyrins")
- OR("porphyrins", "porphyrins analogues")
- OR("Allergy", "Photosensitivity", "Porphyria", "Allergic constitution")